Clinical trial exclusion criterion:
Mental Retardation or Autistic Spectrum Disorder

Entity relations:
- OR("Mental Retardation", "Autistic Spectrum Disorder")